Clinical trial exclusion criterion:
Serious organic or mental disease diagnosed by a psychiatrist (e.g., major depression currently treated with antidepressant medication) suspected on the basis of the medical history and/or clinical examination.

Entity relations:
- Has_qualifier("organic disease", "diagnosed by a psychiatrist")
- Has_temporal("treated", "currently")
- AND("treated", "antidepressant medication")
- AND("major depression", "treated")
- Subsumes("organic disease", "major depression")
- Has_temporal("suspected", "medical history")
- Has_mood("major depression", "suspected")
- OR("organic disease", "mental disease")
- OR("medical history", "clinical examination")